Clinical trial inclusion criteria:
Patients aged between 40 and 60 years old.
With Child score B or C
Presented for elective gastrointestinal endoscopy

Annotated entities:
- Person: "aged"
- Value: "between 40 and 60 years old"
- Measurement: "Child score"
- Value: "B"
- Value: "C"
- Qualifier: "elective"
- Procedure: "gastrointestinal endoscopy"